How large is a lncRNAs?

lncRNAs are defined as RNA transcripts longer than 200 nucleotides that are not transcribed into proteins